Which subcortical brain structure is influenced the most by common genetic variants?

The putamen is the most affected by common genetic variants. It is the subcortical brain structure responsible for learning, memory and motivation.